Clinical trial exclusion criterion:
-Female subjects should refrain from breastfeeding throughout this period.

Entity relations:
- Has_index("throughout this period.", "this period")
- Has_temporal("breastfeeding", "throughout this period.")
- Has_negation("breastfeeding", "refrain from")
- Has_context("Female", "breastfeeding")